一位 7 歲 10 個月女童因母親發現有乳房發育而就診。父親身高 163 公分，母親身高 154 公分。此女童最近 6 個月長 3 公分，身體檢查顯示身高 127 公分（第 75 百分位），體重 30 公斤（第 97 百分位），乳房為 Tanner stage Ⅱ，無陰毛及腋毛發育。其骨齡為 10 歲，於性腺釋素（GnRH）刺激後，血清濾泡促素（FSH）之最高值為 10 IU/L，黃體促素（LH）之最高值為 6 U/L。此時最不適合給病人的母親下列那一項建議？
A. 安排骨盆腔超音波檢查（pelvic sonography）
B. 安排蝶鞍磁振攝影（MRI of sella）
C. 立即給予性腺釋素同構物（GnRH analogue）治療
D. 先予門診追蹤其青春期發育之進展

正確答案：C. 立即給予性腺釋素同構物（GnRH analogue）治療